下列與子宮頸癌最有關係的 HPV（human papillomavirus）typing 為：
A. type 6, 8
B. type 16, 18
C. type 6, 11
D. type 6, 18

正確答案：B. type 16, 18